Clinical trial exclusion criterion:
Severe right heart failure

Annotated entities:
- Condition: "right heart failure"
- Qualifier: "Severe"